Pulmonary lesion consistent with TB by radiological examination

The above is a clinical trial inclusion criterion. Annotated with entity spans:
[Condition: Pulmonary lesion] [Qualifier: consistent with TB] by [Procedure: radiological examination]